Clinical trial inclusion criterion:
For patients previously treated with alglucosidase alfa the patient has received alglucosidase alfa for at least 6 months.

Entity relations:
- Has_temporal("alglucosidase alfa", "for at least 6 months")